The use of insulin within the 3 months prior to screening

The above is a clinical trial exclusion criterion. Annotated with entity spans:
The use of [Drug: insulin] [Temporal: within the 3 months prior to screening]